When was Afrezza approved by the FDA?

Afrezza was approved by the FDA in June 2014.